一位智力正常伴有家族性癲癇病史的14歲女孩，常在起床後被家⻑發現不自主肢體抽搐，有時甚至會跌倒在地上，下列有關診斷及治療的敘述何者錯誤？
A. 腦波可能出現4～6Hz廣泛性棘波（generalized spikes）
B. 家族癲癇基因的檢測有助於診斷
C. 抗癲癇藥（valproate）是治療首選藥物
D. 診斷可能為兒童失神性癲癇

正確答案：D. 診斷可能為兒童失神性癲癇